Signed informed consent by patient self or legally authorized representatives.

The above is a clinical trial inclusion criterion. Annotated with entity spans:
[Informed_consent: Signed informed consent by patient self or legally authorized representatives.]